Clinical trial inclusion criterion:
Age >12 months

Entity relations:
- Has_value("Age", ">12 months")